下列何者不是結腸的特徵？
A. 完全為腹膜內器官
B. 具脂肪垂（omental appendices）
C. 管壁的縱肌特化為三條帶狀的taeniae coli
D. 袋狀管壁外觀（haustra）

正確答案：A. 完全為腹膜內器官